下列何者不為診斷糖尿病的條件？
A. 有典型的三多症狀，加上隨機血糖（random blood sugar）＞200 mg/dL
B. 尿液中可檢驗出葡萄糖
C. 2 次空腹血糖值超過 126 mg/dL
D. 口服 75 公克葡萄糖 2 小時後之血糖值超過 200 mg/dL

正確答案：B. 尿液中可檢驗出葡萄糖